Clinical trial exclusion criterion:
Other significant co-morbid disease that would prevent participation in exercise

Entity relations:
- Has_qualifier("co-morbid disease", "significant")
- Has_qualifier("co-morbid disease", "that would prevent participation in exercise")